Clinical trial exclusion criterion:
Known asthmatic or history of allergy towards peanut or milk products

Annotated entities:
- Condition: "asthmatic"
- Temporal: "history"
- Condition: "allergy"
- Drug: "peanut"
- Drug: "milk products"